食用未熟之螺肉，會感染下列何種人體寄生蟲？
A. 海獸胃線蟲（Anisakis simplex）
B. 菲律賓毛線蟲（Capillaria philippinensis）
C. 廣東住血線蟲（Angiostrongylus cantonensis）
D. 中華肝吸蟲（Clonorchis sinensis）

正確答案：C. 廣東住血線蟲（Angiostrongylus cantonensis）